Joven de 18 años de edad con antecedentes de asma, alergia a pólenes, ácaros y pelo de gato, acude a urgencia refiriendo sensación de detención de alimentos a nivel retroesternal con práctica incapacidad para deglutir su propia saliva. Refiere episodios similares en otras ocasiones que han cedido de forma espontánea en pocos minutos. ¿Cuál de los siguientes es el diagnóstico más probable?
1. Esófago de Barrett.
2. Anillo esofágico distal (Schaztki).
3. Esofagitis infecciosa.
4. Esofagitis eosinofílica.

Respuesta correcta: 4. Esofagitis eosinofílica.